Subjects with acute liver disease or active peptic ulcer disease.

The above is a clinical trial exclusion criterion. Annotated with entity spans:
Subjects with [Condition: acute liver disease] or [Temporal: active] [Condition: peptic ulcer disease].